下列關於急性心肌梗塞的敘述，何者錯誤？
A. 可能因僧帽瓣破裂（mitral valve）而併發急性僧帽瓣閉鎖不全（mitral regurgitation），需要緊急手術
B. 若發生心室中隔破裂（ventricular septal rupture）需要緊急手術
C. 若發生左心室游離壁破裂（left ventricular freewall rupture）需要緊急手術
D. 主動脈內氣球幫浦（intra-aortic balloon pumping）常用於急性心肌梗塞併發休克

正確答案：A. 可能因僧帽瓣破裂（mitral valve）而併發急性僧帽瓣閉鎖不全（mitral regurgitation），需要緊急手術